Clinical trial exclusion criterion:
age <18 years

Entity relations:
- Has_value("age", "<18 years")